Metastatic disease

The above is a clinical trial inclusion criterion. Annotated with entity spans:
[Condition: Metastatic disease]